Clinical trial inclusion criterion:
treated with chemotherapy and/or immunosuppressive therapy

Annotated entities:
- Procedure: "chemotherapy"
- Procedure: "immunosuppressive therapy"